Clinical trial exclusion criteria:
The patient is unwilling to provide informed consent
acutely sick (for example, crying, wheezing, bleeding, screaming or shaken)
unable to participate in a discussion about the study

Annotated entities:
- Informed_consent: "The patient is unwilling to provide informed consent"
- Condition: "acutely sick"
- Condition: "crying"
- Condition: "wheezing"
- Condition: "bleeding"
- Condition: "screaming"
- Condition: "shaken"
- Non-query-able: "unable to participate in a discussion about the study"